有關鴉片類成癮（opioid dependence）治療之敘述，何者錯誤？
A. 美沙冬（methadone）戒斷症狀較輕微，過量也不會抑制呼吸
B. 丁基原啡因（buprenorphine）可減弱或阻斷海洛因及嗎啡的作用，且可帶回家自行服用
C. 臨床上已不再使用 levomethadyl 是因為可能引起心電圖 QT 間隔延長及 Torsades de pointes
D. Naltrexone 可阻斷欣快感而減少病患尋求海洛因之行為，但較缺乏使病患願意連續使用之機制

正確答案：A. 美沙冬（methadone）戒斷症狀較輕微，過量也不會抑制呼吸